La inspiración favorece al retorno venoso porque:
1. Disminuye la presión venosa central.
2. Aumenta la presión arterial.
3. Incrementa la presión intratorácica.
4. Disminuye la presión capilar pulmonar.

Respuesta correcta: 1. Disminuye la presión venosa central.